Una recomendación adecuada para una paciente con diagnóstico reciente de osteoporosis es:
1. Realizar ejercicios isométricos.
2. Dejar de fumar.
3. Tomar una dieta rica en fibra.
4. Limitar la actividad física.
5. Evitar la ingesta de bifosfonatos.

Respuesta correcta: 2. Dejar de fumar.